跳躍者膝痛（jumper's knee）主要指的是下列何種病變？
A. 髕骨軟化症（chondromallacia patellae）
B. 髕肌腱炎（patellar tendinitis）
C. 前十字韌帶裂傷（anterior cruciate ligament tear）
D. 半月狀軟骨破裂（meniscus rupture）

正確答案：B. 髕肌腱炎（patellar tendinitis）